與腹腔內感染（intra-abdominal infections）相關的敘述，下列何者錯誤？
A. 電腦斷層攝影（abdominal computed tomography）有助於診斷腹腔內感染
B. 如果沒有妥善處理，會導致多器官功能障礙症候群（multiple organ dysfunction syndrome）
C. 所有的腹腔內感染都必須手術治療
D. 老年人及營養不良者之腹腔內感染比較有發生併發症的風險

正確答案：C. 所有的腹腔內感染都必須手術治療